Clinical trial inclusion criterion:
Baseline LIC >7 mg/g dw (measured by MRI);

Entity relations:
- Has_value("Baseline LIC", ">7 mg/g")
- AND("Baseline LIC", "MRI")